4. Patients with Magnetic resonance imaging contraindication ,including claustrophobic syndrome patients

The above is a clinical trial exclusion criterion. Annotated with entity spans:
4. Patients with [Procedure: Magnetic resonance imaging] [Condition: contraindication] ,including [Condition: claustrophobic syndrome] patients